Clinical trial inclusion criterion:
HCV genotyping 1a, 1b, or mixed 1a/ab. Any non-definitive results will exclude the subject from study participation.

Annotated entities:
- Measurement: "HCV genotyping"
- Value: "1a, 1b, or mixed 1a/ab"
- Non-representable: "Any non-definitive results will exclude the subject from study participation."